Clinical trial exclusion criterion:
History of bupivacaine allergy

Entity relations:
- AND("allergy", "bupivacaine")
- Has_temporal("allergy", "History")